Clinical trial exclusion criterion:
Children (<18 years old).

Entity relations:
- Has_value("old", "<18 years")
- Subsumes("Children", "old")